下列何者不在陰莖深筋膜（deep fascia of the penis）內？
A. 陰莖襻狀韌帶（fundiform ligament of penis）
B. 陰莖深背靜脈（deep dorsal vein of penis）
C. 陰莖背動脈（dorsal artery of penis）
D. 尿道海綿體（corpus spongiosum）

正確答案：A. 陰莖襻狀韌帶（fundiform ligament of penis）